Planned hospitalization during the study period, for any diagnostic or treatment procedures.

The above is a clinical trial exclusion criterion. Annotated with entity spans:
[Mood: Planned] [Procedure: hospitalization] [Temporal: during the study period], for any [Procedure: diagnostic] or [Procedure: treatment procedures].